下列有關乾癬之敘述，何者錯誤？
A. 乙型交感阻斷劑（β-blockers）可能會誘發或惡化乾癬
B. 精神壓力可能使乾癬惡化
C. 是 B 淋巴球（B lymphocyte）活化引起之疾病
D. 急性鏈球菌感染可能誘發滴狀乾癬（guttate psoriasis）

正確答案：C. 是 B 淋巴球（B lymphocyte）活化引起之疾病